retrospectively, with any significant change in motor function over at least one year, unrelated to relapse.

The above is a clinical trial inclusion criterion. Annotated with entity spans:
retrospectively, with any [Qualifier: significant] [Condition: change in motor function] [Temporal: over at least one year], [Qualifier: unrelated to relapse].